下列何者伴行脛前動脈（anterior tibial artery）且負責支配脛前肌（tibialis anterior）？
A. 脛神經（tibial nerve）
B. 隱神經（saphenous nerve）
C. 腓深神經（deep fibular nerve）
D. 腓淺神經（superficial fibular nerve）

正確答案：C. 腓深神經（deep fibular nerve）